For patients >=60 years of age: any 2 of the following:

The above is a clinical trial inclusion criterion. Annotated with entity spans:
For patients [Value: >=60 years] of [Person: age]: any 2 of the following: